Clinical trial exclusion criterion:
Active bleeding or known bleeding disorder/diathesis

Entity relations:
- OR("Active bleeding", "diathesis", "bleeding disorder")